What is REVIGO?

REVIGO summarizes and visualizes long lists of gene ontology terms.